weight </= 100kg

The above is a clinical trial inclusion criterion. Annotated with entity spans:
[Measurement: weight] [Value: </= 100kg]